Guardianship patients

The above is a clinical trial exclusion criterion. Annotated with entity spans:
[Non-query-able: Guardianship patients]